Clinical trial exclusion criterion:
Pregnancy

Annotated entities:
- Condition: "Pregnancy"